Clinical trial exclusion criterion:
Contraindication to beta-blocker

Annotated entities:
- Condition: "Contraindication"
- Drug: "beta-blocker"